Clinical trial inclusion criteria:
Stage IA or IIA disease
Not specified
No prior therapy

Annotated entities:
- Non-representable: "Stage IA or IIA disease"
- Non-representable: "Not specified"
- Non-representable: "No prior therapy"